Clinical trial exclusion criterion:
Trauma recent face, nausea and vomiting.

Annotated entities:
- Condition: "Trauma"
- Condition: "nausea"
- Condition: "vomiting"